Clinical trial inclusion criterion:
BMI >27 to 45

Annotated entities:
- Person: "BMI"
- Value: ">27 to 45"